Ligament of Treitz 是檢查消化道是否發生異常的標記，其拉提著下列何處？
A. 十二指腸與胃幽門的交界處
B. 十二指腸的上段（superior part）與下行段（descending part）間
C. 十二指腸空腸彎曲（duodenojejunal flexure）
D. 整條十二指腸

正確答案：C. 十二指腸空腸彎曲（duodenojejunal flexure）